Pancreatectomy

The above is a clinical trial inclusion criterion. Annotated with entity spans:
[Procedure: Pancreatectomy]